大腸組織中，下列何者最少？
A. 杯狀細胞（goblet cells）
B. 潘氏細胞（Paneth cells）
C. 腸內分泌細胞（enteroendocrine cells）
D. 黏膜上皮細胞（epithelial cells of mucosa）

正確答案：B. 潘氏細胞（Paneth cells）